Clinical trial inclusion criterion:
Able to provide written informed consent prior to study participation. .

Annotated entities:
- Observation: "written informed consent"
- Temporal: "prior to study participation"
- Reference_point: "study participation"